Clinical trial inclusion criterion:
Must be amenable to randomization into either cohort

Annotated entities:
- Post-eligibility: "Must be amenable to randomization into either cohort"